¿Qué cuidados se deben planificar cuando la mujer alcanza la menopausia?
1. Ninguno, la menopausia es un periodo normal del ciclo reproductivo de la mujer.
2. Ninguno, pero hay que remitirla a ginecología para que empiece cuanto antes el tratamiento hormonal sustitutivo y no padezca clínica climatérica.
3. Hay que valorar su estado general y planificar cuidados de prevención de la depresión climatérica.
4. Hay que planificar cuidados de prevención de síntomas vasomotores, osteoporosis y obesidad.
5. Hay que planificar un estudio detallado de los niveles hormonales que nos permita determinar la medicación y los cuidados más adecuados a su déficit hormonal.

Respuesta correcta: 4. Hay que planificar cuidados de prevención de síntomas vasomotores, osteoporosis y obesidad.